Mujer de 67 años diagnosticada de un carcinoma ductal infiltrante de mama y sin historia familiar de neoplasia. ¿Qué estudios adicionales deben realizarse en el tumor por sus implicaciones clínico-terapéuticas?
1. Estudio fenotípico completo mediante citometría de flujo.
2. Estudio de receptores hormonales y de HER2.
3. Estudio de receptores hormonales, ecadherina y estudio de familiares de primer grado.
4. Estudio de BRCA 1-2 y estudio de familiares de primer grado.

Respuesta correcta: 2. Estudio de receptores hormonales y de HER2.